Clinical trial exclusion criterion:
5. Transmural myocardial infarction within the previous seven days and CK has not returned to normal;

Entity relations:
- Has_negation("normal", "has not returned")
- Has_value("CK", "normal")
- Has_temporal("Transmural myocardial infarction", "within the previous seven days")
- AND("Transmural myocardial infarction", "CK")